Active infectious endocarditis

The above is a clinical trial exclusion criterion. Annotated with entity spans:
[Qualifier: Active] [Condition: infectious endocarditis]